Describe mechanism of action of Romosozumab.

Romosozumab, a humanized monoclonal antibody that binds to sclerostin, prevents sclerostin from exerting this inhibitory effect. In the presence of romosozumab, the Wnt signaling pathway is activated leading to bone formation and bone mineral density gain. It is used for osteoporosis treatment.